Patient presents a normal eye fundus.

The above is a clinical trial inclusion criterion. Annotated with entity spans:
Patient presents a [Condition: normal eye fundus].